Clinical trial exclusion criterion:
Previous treatment with cytotoxic agents or high-dose steroids

Entity relations:
- AND("treatment", "cytotoxic agents")
- Has_temporal("treatment", "Previous")
- OR("cytotoxic agents", "high-dose steroids")